Clinical trial exclusion criterion:
Ulcers due to non-diabetic etiology.

Entity relations:
- Has_qualifier("Ulcers", "non-diabetic")